Evidence of decompensated liver disease (Childs B-C), hepato-cellular carcinoma, pre-existing severe depression or other psychiatric disease, significant cardiac disease, significant renal disease, seizure disorders or severe retinopathy.

The above is a clinical trial exclusion criterion. Annotated with entity spans:
Evidence of [Qualifier: decompensated] [Condition: liver disease] ([Measurement: Childs] [Value: B-C]), [Condition: hepato-cellular carcinoma], [Temporal: pre-existing] [Qualifier: severe] [Condition: depression] or [Qualifier: other] [Condition: psychiatric disease], [Qualifier: significant] [Condition: cardiac disease], [Qualifier: significant] [Condition: renal disease], [Condition: seizure disorders] or [Qualifier: severe] [Condition: retinopathy].